List Hemolytic Uremic Syndrome Triad.

Hemolytic uremic syndrome (HUS) is a clinical syndrome characterized by the triad of anaemia, thrombocytopenia, renal failure.